Clinical trial exclusion criterion:
prematurity (<37 weeks)/low birthweight <2500 g

Annotated entities:
- Condition: "prematurity"
- Condition: "low birthweight"
- Measurement: "birthweight"
- Value: "<2500 g"